persons with terminal illness

The above is a clinical trial exclusion criterion. Annotated with entity spans:
persons with [Condition: terminal illness]